Clinical trial exclusion criterion:
Patients with the risk factors for bowel obstruction or bowel perforation (examples include but not limited to a history of acute diverticulitis, intra-abdominal abscess, abdominal carcinomatosis).

Entity relations:
- AND("risk factors for bowel obstruction", "bowel obstruction")
- AND("risk factors for bowel perforation", "bowel perforation")
- Has_temporal("acute diverticulitis", "history")
- Subsumes("risk factors for bowel obstruction", "acute diverticulitis")
- OR("risk factors for bowel obstruction", "risk factors for bowel perforation")
- OR("acute diverticulitis", "intra-abdominal abscess", "abdominal carcinomatosis")